16歲女孩，因遲遲沒有初經，但有乳房發育，外生殖器也屬於典型女性，染色體檢查結果為46, XY，下列何種情況最不可能？
A. 5α-reductase II基因突變
B. 完全型androgen insensitivity syndrome
C. aromatase基因突變或缺損
D. SRY基因突變或缺損

正確答案：C. aromatase基因突變或缺損